Clinical trial inclusion criterion:
age <2 years

Annotated entities:
- Person: "age"
- Value: "<2 years"